HIV controlled on therapy for at least 12 weeks

The above is a clinical trial inclusion criterion. Annotated with entity spans:
[Condition: HIV] [Qualifier: controlled] on therapy for [Temporal: at least 12 weeks]